下列有關葡萄酒斑（port-wine stain）的敘述，何者錯誤？
A. 位於皮膚之血管瘤
B. 位於皮膚之血管畸形
C. 可利用雷射治療
D. 可用手術切除

正確答案：A. 位於皮膚之血管瘤